Clinical trial inclusion criteria:
Clinical diagnosis of calculous cholecystitis.

Annotated entities:
- Condition: "calculous cholecystitis"
- Qualifier: "Clinical diagnosis"